Concurrent enrollment in an investigational study evaluating another device, biologic, or drug.

The above is a clinical trial exclusion criterion. Annotated with entity spans:
[Competing_trial: Concurrent enrollment in an investigational study evaluating another device, biologic, or drug.]